History of myocardial infarction, unstable angina pectoris, coronary bypass surgery, or any percutaneous coronary intervention (PCI) during the 6 months prior to Visit 1

The above is a clinical trial exclusion criterion. Annotated with entity spans:
[Temporal: History] of [Condition: myocardial infarction], [Condition: unstable angina pectoris], [Condition: coronary bypass surgery], or any [Condition: percutaneous coronary intervention (PCI)] [Temporal: during the 6 months prior] to Visit 1